Clinical trial exclusion criterion:
Serious, uncontrolled disease (including serious psychological disorders) likely to interfere with the study or impact on subject safety.

Annotated entities:
- Condition: "uncontrolled disease"
- Condition: "psychological disorders"